Methotrexate used within the previous 6 months

The above is a clinical trial exclusion criterion. Annotated with entity spans:
[Drug: Methotrexate] used [Temporal: within the previous 6 months]